下列有關乳癌發生率之敘述，何者正確？
A. 女與男之比率為 1000：1
B. 有乳癌家族史者，其發病年齡較輕，且較易罹患兩側性乳癌
C. 初經晚而停經早者較初經早而停經晚者為高
D. 脂肪攝取量低之婦女較高攝取者為高

正確答案：B. 有乳癌家族史者，其發病年齡較輕，且較易罹患兩側性乳癌